Clinical trial exclusion criterion:
Best-corrected visual acuity < 20/200 (Snellen equivalent);

Entity relations:
- Has_value("Best-corrected visual acuity", "< 20/200")